一位20歲女性精神科住院病患，濃妝豔抹穿露肩晚禮服，在大廳高歌且手舞足蹈。她自信是最吸引人的巨 星，並深信自己是因為表現太過突出，而遭嫉妒陷害被關在這裡。如要診斷該女士為第一型雙極性疾患
 （bipolar I disorder），下列何者正確？
A. 必須也有重鬱發作（major depressive episode）
B. 上述症狀不一定要造成病人的功能損失
C. 不需考慮藥物之可能影響
D. 必須排除甲狀腺功能亢進或低下造成的影響

正確答案：D. 必須排除甲狀腺功能亢進或低下造成的影響